Clinical trial exclusion criteria:
allergic history to dexmedetomidine
refractory bradycardia < 60 bpm despite treatment
severe atrioventricular block (2nd and 3rd degree)
previous operation of tongue

Annotated entities:
- Condition: "allergic"
- Temporal: "history"
- Drug: "dexmedetomidine"
- Qualifier: "refractory"
- Condition: "bradycardia"
- Value: "< 60 bpm"
- Qualifier: "despite treatment"
- Procedure: "treatment"
- Qualifier: "severe"
- Condition: "atrioventricular block"
- Qualifier: "2nd degree"
- Qualifier: "3rd degree"
- Temporal: "previous"
- Procedure: "operation of tongue"